Clinical trial inclusion criteria:
T2DM as defined by American Diabetes Association (ADA) criteria
Adult patients with T2DM who are indicated to receive liraglutide, not as first-line therapy, in addition to diet and exercise to improve glycemic control
Hemoglobin A1c (HbA1c) = 9%
Age = 18 years old
Body mass index (BMI) = 27 Kg/m2 and/or waist circumference = 102 cm (40 inches) in men and 88 cm (35 inches) in women, respectively.
Clinically and angiographically stable CAD who requires CABG as part of the standard medical care, as CAD does not represent a contraindication for using liraglutide. The stability of the CAD further warranties that study patients will not be exposed to higher risk by using liraglutide

Annotated entities:
- Condition: "T2DM"
- Qualifier: "American Diabetes Association (ADA) criteria"
- Person: "Adult"
- Condition: "T2DM"
- Drug: "liraglutide"
- Mood: "indicated to receive"
- Qualifier: "first-line therapy"
- Negation: "not"
- Non-representable: "in addition to diet and exercise to improve glycemic control"
- Measurement: "Hemoglobin A1c (HbA1c)"
- Value: "= 9%"
- Person: "Age"
- Value: "= 18 years old"
- Measurement: "Body mass index (BMI)"
- Value: "= 27 Kg/m2"
- Measurement: "waist circumference"
- Value: "= 102 cm"
- Value: "40 inches"
- Person: "men"
- Value: "88 cm"
- Value: "35 inches"
- Person: "women"
- Qualifier: "angiographically stable"
- Condition: "CAD"
- Procedure: "CABG"
- Mood: "requires"
- Qualifier: "Clinically stable"
- Non-representable: "as CAD does not represent a contraindication for using liraglutide. The stability of the CAD further warranties that study patients will not be exposed to higher risk by using liraglutide"